Clinical trial exclusion criterion:
Hepatic abnormalities;

Annotated entities:
- Condition: "Hepatic abnormalities"